Which gene is responsible for red hair?

Variants of the melanocyte-stimulating hormone receptor gene are associated with red hair and fair skin in humans.